關於腮腺炎（mumps）的敘述，下列何者錯誤？
A. 是透過呼吸道上皮細胞傳染的疾病
B. 感染都只有呼吸道症狀，不會造成全身性的感染
C. 腮腺炎病毒可以存在尿液中
D. 腮腺炎病毒減毒疫苗的效果很好，是目前使用的三合一疫苗中的一種成分

正確答案：B. 感染都只有呼吸道症狀，不會造成全身性的感染